Clinical trial exclusion criterion:
Pregnant and lactating women.

Annotated entities:
- Pregnancy_considerations: "Pregnant and lactating women"